age less than 18 years

The above is a clinical trial exclusion criterion. Annotated with entity spans:
[Person: age] [Value: less than 18 years]